Clinical trial inclusion criterion:
All patients within adult ICUs are included, including rare patients <18 years and >=12 years.

Entity relations:
- multi("adult ICUs", "adult")
- Has_value("year", "<18 years and >=12 years")